在 DNA 上不常見的 5'-methyl cytosine 被去胺基後（deamination），可見在複製後出現何種突變？
A. CG to TA
B. CG to GC
C. CG to AT
D. G 被去除掉

正確答案：A. CG to TA